有關慢性腎臟病所併發之腎性貧血（renal anemia），下列敘述何者錯誤？
A. 腎性貧血之紅血球型態常為正常血球大小（normocytic）與正常色素性（normochromic）
B. 腎性貧血常出現虛弱、運動耐受力不良（exercise intolerance）、心衰竭與認知功能異常等症狀
C. 因慢性腎臟病病患常合併血液凝集功能異常，故造成腎性貧血最主要的原因為胃腸道出血
D. 將腎性貧血病患之血色素值矯正至正常人標準值（≥13 g/dL），無法改善病患之心血管併發症

正確答案：C. 因慢性腎臟病病患常合併血液凝集功能異常，故造成腎性貧血最主要的原因為胃腸道出血